Patients with relapsing forms of multiple sclerosis (RMS) with active disease defined by clinical or imaging features: (i) at least one clinical relapse over a 6-month period prior to screening; (ii) AND/OR at least one T1 gadolinium-enhancing lesion or new and/or enlarging T2 lesion as detected by brain Magnetic Resonance Imaging (MRI) performed over a 3 months period prior to screening with no change of Disease-Modifying Treatment(s) (DMT) compared to a previous MRI performed within 24 months before screening

The above is a clinical trial inclusion criterion. Annotated with entity spans:
Patients with [Qualifier: relapsing forms] of [Condition: multiple sclerosis (RMS)] with [Qualifier: active disease] defined by [Observation: clinical] or [Observation: imaging features]: (i) [Multiplier: at least one] [Condition: clinical relapse] over a 6-month period [Temporal: prior to screening]; (ii) AND/OR [Multiplier: at least one] [Condition: T1 gadolinium-enhancing lesion] or [Temporal: new] and/or [Qualifier: enlarging] [Condition: T2 lesion] as detected by [Procedure: brain Magnetic Resonance Imaging (MRI)] performed over a 3 months period [Temporal: prior to screening] with [Negation: no] [Multiplier: change of] [Procedure: Disease-Modifying Treatment(s) (DMT)] [Non-representable: compared to a previous MRI performed within 24 months before screening]